治療下列引起低血鉀之疾病，何者較容易產生反彈性高血鉀（rebound hyperkalemia）？
A. 低血鉀週期性無力症（hypokalemic periodic paralysis）
B. Liddle's 症候群（Liddle's syndrome）
C. 糖尿病酮酸血症（diabetic ketoacidosis）
D. 腹瀉（diarrhea）

正確答案：A. 低血鉀週期性無力症（hypokalemic periodic paralysis）